Clinical trial inclusion criterion:
Subjects who are geographically stable and available for follow-up at the study center for the length of the study

Entity relations:
- AND("geographically stable", "at the study center")
- AND("geographically stable", "available for follow-up")
- AND("at the study center", "for the length of the study")